Clinical trial inclusion criterion:
Progression on prior therapy with a hormonal agent if estrogen receptor or progesterone receptor positive, and/or with trastuzumab if HER2-neu positive. If patient has progressed through hormone or trastuzumab therapy only, must have received one chemotherapy regimen.

Annotated entities:
- Observation: "Progression on"
- Temporal: "prior"
- Procedure: "therapy with a hormonal agent"
- Condition: "estrogen receptor positive"
- Condition: "progesterone receptor positive"
- Condition: "HER2-neu positive"
- Procedure: "therapy with trastuzumab"
- Observation: "progressed through"
- Procedure: "hormone therapy"
- Procedure: "trastuzumab therapy"
- Procedure: "chemotherapy regimen"